某國小一年級女童來自農村，家中飼養雞、鴨及豬等動物，於八月多雨之酷暑下突然開始發燒、嘔吐、頭痛，此外還抽筋、意識不清、手部震顫，角弓反張，最後該病人牙關緊閉、四肢僵硬，並呈現昏迷之現象。該患者可能被何種病原菌所感染？
A. 登革病毒（Dengue virus）
B. 禽流感病毒（Influenza virus）
C. 日本腦炎病毒（Japanese encephalitis virus）
D. C 型肝炎病毒（HCV）

正確答案：C. 日本腦炎病毒（Japanese encephalitis virus）